Clinical trial inclusion criterion:
Viral load ≥10000UI/mL.

Annotated entities:
- Measurement: "Viral load"
- Value: "≥10000UI/mL"